Clinical trial exclusion criterion:
Use of oral estrogen therapy, excluding oral contraceptive pills

Annotated entities:
- Procedure: "oral estrogen therapy"
- Drug: "oral contraceptive pills"
- Negation: "excluding"